Clinical trial inclusion criterion:
Naïve cannabis patients with chronic non-cancer and cancer pain (not used cannabis in any presentation in the last 12 weeks)

Annotated entities:
- Qualifier: "chronic"
- Qualifier: "non-cancer"
- Qualifier: "cancer"
- Condition: "pain"
- Measurement: "not"
- Drug: "cannabis"
- Temporal: "in the last 12 weeks"
- Condition: "Naïve cannabis"